What percent of Rheumatoid Arthritis (RA) patients are not responding to anti-TNF therapy?

Anti-tumour necrosis factor (TNF) agents have revolutionized the treatment of patients with rheumatoid arthritis (RA). These therapies are, however, expensive and 30% of patients fail to respond